有關細胞週期（Cell cycle）之敘述何者正確？
A. 大部分人類細胞週期約為 24 小時
B. DNA 複製在 G1期進行
C. 在 S 期進行 DNA 修復
D. 生長因子影響在 G2/M 期

正確答案：A. 大部分人類細胞週期約為 24 小時